Neutrophils ≥1.5 x 109/L.

The above is a clinical trial inclusion criterion. Annotated with entity spans:
[Measurement: Neutrophils] [Value: ≥1.5 x 109/L].